Optune compliance < 75%; they would be excluded from the final analyses.

The above is a clinical trial exclusion criterion. Annotated with entity spans:
[Observation: Optune compliance] [Multiplier: < 75%]; [Non-query-able: they would be excluded from the final analyses].